Clinical trial inclusion criterion:
Patient who are fluid responsive. Fluid responsiveness is defined as increase of > 10% in mean arterial pressure (MAP) after passive leg raising (PLR)

Entity relations:
- Has_qualifier("mean arterial pressure (MAP)", "after passive leg raising (PLR)")
- Has_value("mean arterial pressure (MAP)", "> 10%")
- Subsumes("fluid responsive", "mean arterial pressure (MAP)")